Clinical trial exclusion criterion:
Concurrent medication from Visit 1 and for the duration of the study with any of the prohibited medications: monoamine oxidase inhibitors and tricyclic antidepressants, and ritonavir (a highly potent cytochrome P450 3A4 inhibitor).

Entity relations:
- Subsumes("ritonavir", "cytochrome P450 3A4 inhibitor")
- Subsumes("medication from Visit 1", "monoamine oxidase inhibitors")
- OR("monoamine oxidase inhibitors", "tricyclic antidepressants", "ritonavir")